Confirmed presence of iron deficiency

The above is a clinical trial inclusion criterion. Annotated with entity spans:
Confirmed presence of [Condition: iron deficiency]